Clinical trial inclusion criterion:
Likely suffer moderate-to-severe OSA based on history and physical or have an established diagnosis of OSA (20=AHI=65) based on a prior in-lab Polysomnography

Annotated entities:
- Condition: "OSA"
- Qualifier: "moderate"
- Qualifier: "severe"
- Condition: "OSA"
- Measurement: "AHI"
- Value: "20 =65"